Clinical trial exclusion criterion:
Known pancreatic, renal, hepatic, heart or thyroid diseased

Annotated entities:
- Condition: "thyroid disease"
- Condition: "heart disease"
- Condition: "hepatic disease"
- Condition: "renal disease"
- Condition: "pancreatic disease"